What does intepirdine target?

Intepiridine is a 5-HT6 antagonist.